下列那種病菌造成腸胃道感染所需的菌量最低？
A. 弧菌屬（Vibrio）
B. 沙門氏菌屬（Salmonella）
C. 志賀氏菌屬（Shigella）
D. 耶爾辛氏菌屬（Yersinia）

正確答案：C. 志賀氏菌屬（Shigella）